Clinical trial exclusion criterion:
2. Screening tool: TMS adult safety screening, MRI safety screening, Medical History.

Annotated entities:
- Parsing_Error: "2."
- Procedure: "Screening"
- Procedure: "TMS adult safety screening"
- Procedure: "MRI safety screening"
- Temporal: "Medical History"